Platelets >= 100,000/ul

The above is a clinical trial inclusion criterion. Annotated with entity spans:
[Measurement: Platelets] [Value: >= 100,000/ul]